有關新生兒薦尾部畸胎瘤（neonatal sacrococcygeal teratoma）的敍述，下列何者錯誤？
A. 是新生兒畸胎瘤中最常見者
B. 手術切除時需保留尾骨（coccyx），避免術後馬尾症候群（cauda equina syndrome）發生
C. 手術切除時需結紮中薦部動脈（middle sacral artery）以減少失血
D. 大部分屬良性

正確答案：B. 手術切除時需保留尾骨（coccyx），避免術後馬尾症候群（cauda equina syndrome）發生